Clinical trial exclusion criterion:
Mental , physical incapacity to fill in the questionnaires

Entity relations:
- AND("Mental incapacity", "fill in the questionnaires")
- OR("Mental incapacity", "physical incapacity")